Clinical trial exclusion criterion:
A serious, unstable illness, as judged by the Investigator, during the past 3 months before screening/baseline visit including but not limited to: hepatic, renal, gastro-enterologic, respiratory, cardiovascular, endocrinologic, neurologic or immunologic disease;

Annotated entities:
- Condition: "unstable illness"
- Qualifier: "serious"
- Qualifier: "as judged by the Investigator"
- Temporal: "during the past 3 months before screening/baseline visit"
- Condition: "immunologic disease"
- Condition: "neurologic disease"
- Condition: "endocrinologic disease"
- Condition: "cardiovascular disease"
- Condition: "respiratory disease"
- Condition: "gastro-enterologic disease"
- Condition: "renal disease"
- Condition: "hepatic disease"